Expected life span<6-month

The above is a clinical trial exclusion criterion. Annotated with entity spans:
[Observation: Expected life span][Value: <6-month]